Clinical trial exclusion criterion:
History of immunocompromise, including a positive HIV test result.

Entity relations:
- Has_value("HIV test", "positive")
- AND("History", "immunocompromise")
- OR("immunocompromise", "HIV test")